Which R/Bioconductor package has been developed for visualizing differential amino acid group usage in proteomics?

DagLogo is an R/Bioconductor package for identifying and visualizing differential amino acid group usage in proteomics data.